Clinical trial exclusion criterion:
2. Subject has a severe medical or psychiatric illness that, in the opinion of the Investigator, would affect subject safety or compliance

Entity relations:
- Has_qualifier("psychiatric illness", "severe")
- Has_qualifier("psychiatric illness", "in the opinion of the Investigator, would affect subject safety or compliance")
- Has_qualifier("medical illness", "severe")
- Has_qualifier("medical illness", "in the opinion of the Investigator, would affect subject safety or compliance")